Side effects taking longer than 2 weeks to present.

The above is a clinical trial exclusion criterion. Annotated with entity spans:
[Non-query-able: Side effects taking longer than 2 weeks to present].